下列何者並非自閉症的核心症狀？
A. 社交互動缺損
B. 智能障礙
C. 溝通能力異常
D. 侷限、反覆、固	的行為／興趣／活動

正確答案：B. 智能障礙